¿Qué tipo de receptor es el encargado de activar la mayor parte de las respuestas a la hormona T3?:
1. Una proteína G.
2. Una proteína ABC.
3. Un receptor nuclear.
4. Un receptor acoplado a un canal iónico.
5. Una glicoproteína de membrana plasmática.

Respuesta correcta: 3. Un receptor nuclear.